Is a recipient of a prophylactic or therapeutic HIV vaccine candidate at any time, or a recipient of other experimental vaccine(s) within the last 12 months. For participants who received an experimental vaccine (except HIV vaccine) more than 12 months ago, documentation of the identity of the experimental vaccine must be provided to the sponsor, who will determine eligibility on a case-by-case basis

The above is a clinical trial exclusion criterion. Annotated with entity spans:
Is a recipient of a [Qualifier: prophylactic] or [Qualifier: therapeutic] [Drug: HIV vaccine candidate] [Temporal: at any time], or a recipient of [Drug: other experimental vaccine(s)] [Temporal: within the last 12 months]. For participants who received an [Drug: experimental vaccine] ([Negation: except] [Drug: HIV vaccine]) [Temporal: more than 12 months ago], documentation of the identity of the experimental vaccine must be provided to the sponsor, who will determine eligibility on a [Subjective_judgement: case-by-case basis]